Stage IA or IIA disease

The above is a clinical trial inclusion criterion. Annotated with entity spans:
[Non-representable: Stage IA or IIA disease]